有關食道自發性破裂（Boerhaave's syndrome），下列何者正確？
A. 常與外傷有關
B. 常發生在激烈嘔吐之後
C. 破裂處常發生在頸部食道
D. 通常給予抗生素治療就可以解決病患的問題，如果感染無法控制再考慮外科手術

正確答案：B. 常發生在激烈嘔吐之後